Clinical trial exclusion criterion:
Hemochromatosis, iron overload, defined as TSAT > 45%

Entity relations:
- Has_value("TSAT", "> 45%")
- Subsumes("Hemochromatosis", "iron overload")
- Subsumes("iron overload", "TSAT")